Clinical trial inclusion criterion:
Ovarian, endometrial or cervical - Gynecologic Oncology Group (GOG) performance score ≤2

Annotated entities:
- Measurement: "Gynecologic Oncology Group (GOG) performance score"
- Value: "≤2"
- Qualifier: "Ovarian"
- Qualifier: "endometrial"
- Qualifier: "cervical"